Clinical trial exclusion criterion:
Documented allergy to oxycodone, morphine sulfate or acetaminophen

Entity relations:
- AND("allergy", "oxycodone")
- OR("oxycodone", "acetaminophen", "morphine sulfate")